誘發性呼吸量測儀（incentive spirometry）於手術後使用最主要的目的為避免：
A. 氣胸
B. 肺水腫
C. 肺擴張不全
D. 鬱血性心衰竭

正確答案：C. 肺擴張不全